Patient has received a liver transplant from a non-heart beating donor

The above is a clinical trial exclusion criterion. Annotated with entity spans:
Patient has received a [Procedure: liver transplant] from a [Negation: non]-[Qualifier: heart beating] [Person: donor]